Clinical trial inclusion criterion:
(2)Exhibited good tolerance to enalapril and good overall medication compliance (>80%) in run-in period or previously exhibited good tolerance and adherence to ACEI drugs in previous medication history.

Entity relations:
- multi("good tolerance to enalapril", "enalapril")
- Has_value("overall medication compliance", "good")
- Subsumes("good", ">80%")
- multi("good tolerance to ACEI drugs", "ACEI drugs")
- multi("good adherence to ACEI drugs", "ACEI drugs")
- Has_temporal("good tolerance to ACEI drugs", "previously")
- Has_temporal("good tolerance to ACEI drugs", "medication history")
- Has_temporal("good adherence to ACEI drugs", "previously")
- Has_temporal("good adherence to ACEI drugs", "medication history")
- OR("good tolerance to enalapril", "good tolerance to ACEI drugs")
- OR("overall medication compliance", "good tolerance to ACEI drugs")